Clinical trial exclusion criterion:
Trauma recent face, nausea and vomiting.

Entity relations:
- OR("Trauma", "nausea", "vomiting")